patients with opening of cervical internal os (4 mm of dilatation at the time of consultation);

The above is a clinical trial exclusion criterion. Annotated with entity spans:
patients with [Observation: opening of cervical internal os] ([Value: 4 mm of dilatation] at the time of consultation);